Clinical trial inclusion criterion:
Patients of both sexes aged 35 to 65 years

Annotated entities:
- Person: "sexes"
- Value: "both"
- Person: "aged"
- Value: "35 to 65 years"